What is Desomorphine?

"Krokodil" is the street name for the homemade injectable mixture that has been used as a cheap substitute for heroin. Desomorphine is an opioid misused as "crocodile", a cheaper alternative to heroin.